88 歲女性居住在護理之家，身體狀況不甚良好，近來有解尿及排便障礙，內診時發現整個子宮脫垂至外陰部，下列何種治療較適當？
A. 經腹部子宮懸吊手術（transabdominal uterine suspension）
B. 嘗試子宮托（trial of pessary）
C. 手術將陰道關閉（colpocleisis）
D. 經陰道子宮懸吊手術（transvaginal uterine suspension）

正確答案：B. 嘗試子宮托（trial of pessary）